Clinical trial exclusion criterion:
2hr glucose during OGTT >200 mg/dL

Annotated entities:
- Measurement: "2hr glucose during OGTT"
- Value: ">200 mg/dL"